PRA > 50%

The above is a clinical trial exclusion criterion. Annotated with entity spans:
[Measurement: PRA] [Value: > 50%]